Clinical trial inclusion criterion:
Clinical diagnosis of calculous cholecystitis.

Entity relations:
- Has_qualifier("calculous cholecystitis", "Clinical diagnosis")